Clinical trial exclusion criterion:
Patient has received a liver transplant from a non-heart beating donor

Annotated entities:
- Procedure: "liver transplant"
- Person: "donor"
- Qualifier: "heart beating"
- Negation: "non"